Clinical trial exclusion criterion:
4. The subject's upper arm circumference not adequate for proper fit of the EMG monitor (less than 14cm).

Annotated entities:
- Parsing_Error: "4."
- Measurement: "upper arm circumference"
- Qualifier: "adequate for proper fit of the EMG monitor"
- Negation: "not"
- Non-query-able: "adequate for proper fit of the EMG monitor"
- Value: "less than 14cm"